Non-cirrhotic portal hypertension causing esophageal varices

The above is a clinical trial exclusion criterion. Annotated with entity spans:
[Condition: Non-cirrhotic portal hypertension] causing [Condition: esophageal varices]